Clinical trial inclusion criterion:
Patients with reproductive capability must agree to practice adequate contraception methods.

Annotated entities:
- Qualifier: "adequate"
- Procedure: "contraception methods"
- Condition: "reproductive capability"